What virus is the  Gardisil vaccine used for?

Gordisil is a 4-component vaccine against capsular Meningococcus serogroup B (4CMenB), which has recently been licensed in Europe, Canada and Australia.